一位 55 歲乳癌患者於手術切除後病理切片報告為 infiltrating ductal carcinoma，estrogen receptor 陽性， progesterone receptor 陰性，Her-2 染色呈陰性，無淋巴結轉移。術後患者接受口服 Tamoxifen 治療。三年以後，因左腿嚴重疼痛至門診檢查。同位素骨骼掃描發現全身多處骨骼轉移，下列何種治療對該病人最沒有幫助？
A. 局部放射線治療
B. 第二線荷爾蒙拮抗治療
C. 雙磷酸鹽（bisphosphonate）藥物治療
D. humanized antibody Herceptin 治療

正確答案：D. humanized antibody Herceptin 治療